20. Significant/chronic renal insufficiency.

The above is a clinical trial exclusion criterion. Annotated with entity spans:
[Parsing_Error: 20.] [Qualifier: Significant]/[Condition: chronic renal insufficiency].